Clinical trial inclusion criterion:
BMI < 30

Entity relations:
- Has_value("BMI", "< 30")